Subject with a severe chronic or acute liver disease, history of moderate (Child-Pugh B), or severe (Child-Pugh C) hepatic impairment

The above is a clinical trial exclusion criterion. Annotated with entity spans:
Subject with a [Qualifier: severe] [Condition: chronic] or [Condition: acute] liver disease, history of [Qualifier: moderate] ([Measurement: Child-Pugh] [Value: B]), or [Qualifier: severe] ([Measurement: Child-Pugh] [Value: C]) [Condition: hepatic impairment]